Clinical trial exclusion criterion:
2. Screening tools: SCID Screen Patient Questionnaire. Potential diagnoses will be further evaluated by a counselor. Drug Use Survey (DUS), Substance Use Disorder Evaluation.

Annotated entities:
- Parsing_Error: "2."
- Not_a_criteria: "Potential diagnoses will be further evaluated by a counselor."
- Subjective_judgement: "Potential diagnoses will be further evaluated by a counselor."
- Procedure: "Drug Use Survey (DUS)"
- Procedure: "Substance Use Disorder Evaluation"
- Not_a_criteria: "Drug Use Survey (DUS), Substance Use Disorder Evaluation."
- Parsing_Error: "Drug Use Survey (DUS), Substance Use Disorder Evaluation."
- Parsing_Error: "Potential diagnoses will be further evaluated by a counselor."
- Procedure: "SCID Screen Patient Questionnaire"
- Parsing_Error: "Screening tools: SCID Screen Patient Questionnaire."
- Not_a_criteria: "Screening tools: SCID Screen Patient Questionnaire."